Clinical trial exclusion criterion:
Preoperative Heart Rate less than 50 beat/min

Annotated entities:
- Measurement: "Preoperative Heart Rate"
- Value: "less than 50 beat/min"